Una mujer de 26 años acude a Urgencias por dolor abdominal y escasas pérdidas hemáticas vaginales. Refiere una amenorrea de 7 semanas. Le realiza un test de embarazo, con resultado positivo. ¿Cuál es el siguiente paso?
1. Realizar un examen ecográfico vaginal.
2. Recomendar reposo domiciliario y repetir el test de embarazo en una semana.
3. Evacuar el útero mediante legrado por aspiración.
4. Pautar progesterona natural micronizada por vía vaginal hasta la semana 14 de gestación.
5. Evacuar el útero mediante la administración intravaginal de prostaglandinas.

Respuesta correcta: 1. Realizar un examen ecográfico vaginal.